Clinical trial inclusion criterion:
Age range: 14 to 65 years-old;

Annotated entities:
- Person: "Age"
- Value: "14 to 65 years-old"